Clinical trial inclusion criterion:
Patient with healthcare insurance

Annotated entities:
- Non-query-able: "Patient with healthcare insurance"